Explain the use of Radio Frequency Ablation as a treatment

Radiofrequency ablation is a simple, safe, and effective treatment option for the treatment of castration-resistant ovarian cancer.